前列腺動脈（prostatic artery）主要源自下列何處？
A. 膀胱下動脈（inferior vesical artery）
B. 膀胱上動脈（superior vesical artery）
C. 睪丸動脈（testicular artery）
D. 直腸下動脈（inferior rectal artery）

正確答案：A. 膀胱下動脈（inferior vesical artery）